Clinical trial inclusion criterion:
hypertension medications taken on morning of surgery (except diuretics)

Annotated entities:
- Drug: "hypertension medications"
- Temporal: "on morning of surgery"
- Drug: "diuretics"
- Negation: "except"